Clinical trial exclusion criterion:
Lack of capacity or willingness to consent

Entity relations:
- Has_negation("capacity to consent", "Lack of")
- OR("capacity to consent", "willingness to consent")